下列有關 inositol 1, 4, 5-triphosphate 的敘述，何者正確？
A. 可將 G protein 磷酸化
B. 可由 phospholipase A 所催化之反應產生
C. 經由活化之 phospholipase C 分解產生的 second messenger
D. 可活化 protein kinase A

正確答案：C. 經由活化之 phospholipase C 分解產生的 second messenger